Un niño de 18 meses decía “paque” cuando quería salir al parque. Este tipo de palabras aisladas, que representan el sentido de una frase entera, ¿cómo se denomina?:
1. Palabras referenciales.
2. Palabras multimodales.
3. Palabras pre-lingüísticas.
4. Frases pivote.
5. Holofrases.

Respuesta correcta: 5. Holofrases.